Clinical trial exclusion criterion:
Prior enrolment in a BWATT program

Annotated entities:
- Non-representable: "Prior enrolment in a BWATT program"